Clinical trial exclusion criteria:
no consent
periprocedural complications requiring continuation of heparin or administration of protamine sulfate
alergy to fish, protamine, protamine derivates, history of Humulin N, Novolin N, Novolin NPH, Gensulin N, SciLin N, NPH Iletin II and isophane insulin intake

Annotated entities:
- Informed_consent: "no consent"
- Condition: "periprocedural complications"
- Drug: "heparin"
- Drug: "protamine sulfate"
- Mood: "requiring"
- Condition: "alergy"
- Drug: "fish"
- Drug: "protamine"
- Drug: "protamine derivates"
- Drug: "Humulin N"
- Drug: "Novolin N"
- Drug: "Novolin NPH"
- Drug: "Gensulin N"
- Drug: "SciLin N"
- Drug: "NPH Iletin II"
- Drug: "isophane insulin"
- Temporal: "history"